Clinical trial inclusion criteria:
Menopausal status
Sexually active

Annotated entities:
- Condition: "Menopausal"
- Observation: "Sexually active"